有關預防嬰幼兒過敏的觀念，下列敘述何者最不恰當？
A. 孕婦飲食不需避免高過敏食物（例如海鮮、花生等）
B. 建議在4～6個月大可開始添加副食品
C. 母乳哺育對於預防氣喘的效果不確定
D. 按照國際指引建議嬰幼兒常規性使用益生菌來預防過敏

正確答案：D. 按照國際指引建議嬰幼兒常規性使用益生菌來預防過敏